高免疫球蛋白M症候群（hyper-IgM syndrome）是一種罕見的先天性免疫不全疾病，患者血清中除了IgM之外其他類型，例如IgG和IgA數值明顯低於平均值，造成病患容易感染。B細胞中特定基因的缺陷會造成B細胞無法產生類型轉換（class switching），但是T細胞的基因突變也可以導致相同的疾病。以下那個蛋白質缺陷會造成T細胞無法幫助B細胞類型轉換？
A. AID（activation-induced cytidine deaminase）
B. CD40
C. CD40 ligand
D. NEMO（NF-κB essential modulator， 或稱IKK γ）

正確答案：C. CD40 ligand